下列那些寄生蟲的幼蟲可穿過皮膚進入人體而造成感染？①單胞絛蟲（Echinococcus granulosus）  ②曼森裂頭絛蟲（Spirometra mansonoides） ③日本血吸蟲（Schistosoma japonicum） ④橫川吸蟲
 （Metagonimus yokogawai）
A. ①②
B. ①④
C. ②③
D. ③④

正確答案：C. ②③